Clinical trial exclusion criterion:
Patients not suffering from endometrial or epithelial ovarian cancer

Entity relations:
- Has_negation("endometrial ovarian cancer", "not")
- OR("endometrial ovarian cancer", "epithelial ovarian cancer")